contra-indication to inhalational induction (full stomach)

The above is a clinical trial exclusion criterion. Annotated with entity spans:
[Condition: contra-indication] to [Procedure: inhalational induction] ([Qualifier: full stomach])